Clinical trial exclusion criterion:
Life expectancy <6 months.

Entity relations:
- Has_value("Life expectancy", "<6 months")